下列那一項構造，位於胚胎之胸心包膜（pleuropericardial membrane）內？
A. 膈神經（phrenic nerve）
B. 肺芽（lung bud）
C. 背側主動脈（dorsal aorta）
D. 食道（esophagus）

正確答案：A. 膈神經（phrenic nerve）